Señale cuál de las siguientes afirmaciones sobre el músculo liso vascular es FALSA:
1. Su principal función es mantener el tono de los vasos.
2. Se contrae por un aumento en la concentración intracelular de calcio.
3. Su contracción está controlada por la unión del calcio a la troponina.
4. Su tono está controlado por el sistema nervioso autónomo.
5. El endotelio modula el tono del músculo liso vascular.

Respuesta correcta: 3. Su contracción está controlada por la unión del calcio a la troponina.